Contraindications to progestogens or oral contraceptive pills

The above is a clinical trial exclusion criterion. Annotated with entity spans:
[Condition: Contraindications] to [Drug: progestogens] or [Drug: oral contraceptive pills]